Clinical trial exclusion criterion:
Allergy to NAC

Entity relations:
- AND("Allergy", "NAC")